Willingness to replace the missing tooth/teeth with dental implants

The above is a clinical trial inclusion criterion. Annotated with entity spans:
[Post-eligibility: Willingness to replace the missing tooth/teeth with dental implants]